Acute myocardial infarction identified by ECG

The above is a clinical trial exclusion criterion. Annotated with entity spans:
[Condition: Acute myocardial infarction] identified by [Procedure: ECG]